Clinical trial inclusion criterion:
Be scheduled for trans-jugular liver biopsy the day of the ultrasound procedure.

Entity relations:
- AND("ultrasound procedure", "ultrasound procedure")
- Has_index("the day of the ultrasound procedure", "ultrasound procedure")
- Has_temporal("trans-jugular liver biopsy", "the day of the ultrasound procedure")